Severe respiratory and circulatory system diseases.

The above is a clinical trial exclusion criterion. Annotated with entity spans:
[Qualifier: Severe] [Condition: respiratory] and [Condition: circulatory system disease]s.